Clinical trial exclusion criterion:
History of eclampsia or other adverse CNS complication (e.g., stroke or PRES) in this pregnancy

Annotated entities:
- Condition: "eclampsia"
- Condition: "CNS complication"
- Condition: "stroke"
- Condition: "PRES"
- Temporal: "in this pregnancy"